20歲、60公斤體重健康大學生，於餐廳打工時不慎打翻熱茶桶。高溫熱茶潑及他的兩側下肢，造成此二肢體全部燙傷起水泡。依據「9的規則」（rule of nines）與「帕克蘭公式」（Parkland formula）估算，下列關於此學生之「燙傷面積」及「受傷後24小時靜脈輸液量」敘述，何者最適當？
A. 36%體表面積、8,640公撮（miniliters, mL.）晶質溶液（crystalloid）
B. 36%體表面積、3,240公撮晶質溶液（crystalloid）加上1,080公撮膠質溶液（colloid）
C. 45%體表面積、10,8000公撮晶質溶液
D. 45%體表面積、4,050公撮晶質溶液加上1,350公撮膠質溶液

正確答案：A. 36%體表面積、8,640公撮（miniliters, mL.）晶質溶液（crystalloid）